Clinical trial exclusion criterion:
17. Concomitant administration of any drug that could affect bleeding (e.g., aspirin, clopidogrel, ticlopidine, warfarin, heparin, low-molecular weight heparin)

Annotated entities:
- Parsing_Error: "17."
- Drug: "drug that could affect bleeding"
- Undefined_semantics: "drug that could affect bleeding"
- Drug: "aspirin"
- Drug: "clopidogrel"
- Drug: "ticlopidine"
- Drug: "warfarin"
- Drug: "heparin"
- Drug: "low-molecular weight heparin"